下列那一種物質在飲水中含量過高時，對嬰兒會引發藍嬰症（methemoglobinemia）？
A. 硝酸鹽
B. 磷酸鹽
C. 硫酸鹽
D. 氰酸鹽

正確答案：A. 硝酸鹽